Clinical trial exclusion criterion:
Any current psychiatric disorder, other than Alcohol Use Disorder, that, in the judgment of the investigator, will require treatment that will interfere with study participation.

Entity relations:
- Has_negation("Alcohol Use Disorder", "other than")
- AND("psychiatric disorder", "Alcohol Use Disorder")
- Has_temporal("psychiatric disorder", "current")